Clinical trial inclusion criterion:
Has at least one measurable lesion based on RECIST version 1.1 as determined by investigator

Entity relations:
- Has_value("RECIST version 1.1", "measurable")
- AND("lesion", "RECIST version 1.1")
- Has_multiplier("lesion", "at least one")